Minimal use of chlorhexidine bathing*

The above is a clinical trial inclusion criterion. Annotated with entity spans:
[Multiplier: Minimal use] of [Procedure: chlorhexidine bathing]*